Eastern Cooperative Oncology Group (ECOG) performance status and/or other performance status 0, 1, or 2 at time of enrollment.

The above is a clinical trial inclusion criterion. Annotated with entity spans:
[Measurement: Eastern Cooperative Oncology Group (ECOG) performance status] and/or other performance status [Value: 0, 1, or 2] [Temporal: at time of enrollment].